La desnaturalización del ADN:
1. Aumenta al disminuir la temperatura.
2. Se acompaña por un aumento de la absorción de luz UV.
3. Los ADN con alto contenido en G/C lo hacen a menor temperatura que los ricos en A/T.
4. Es irreversible.
5. Indica la hidrólisis de los enlaces fosfodiéster.

Respuesta correcta: 2. Se acompaña por un aumento de la absorción de luz UV.